Clinical trial exclusion criterion:
Known or suspected liver diseases

Entity relations:
- Has_qualifier("liver diseases", "Known")
- OR("Known", "suspected")